一位酗酒病人因意識不清、劇烈嘔吐被送至急診室。其血液生化檢查及動脈血分析如下：pH：7.40、 PaCO2：40 mmHg、HCO3：24 mEq/L、Glucose：120 mg/dL、BUN：10 mg/dL、Creatinine：0.7 mg/dL、
 mEq/L、K：2.6 mEq/L、Cl：80 mEq/L、Acetone：3+，則下列何者為正確的診斷？
A. 血液酸鹼值正常無代謝性酸鹼疾病
B. 代謝性酸中毒合併代謝性鹼中毒
C. 代謝性酸中毒合併呼吸性鹼中毒
D. 代謝性鹼中毒合併呼吸性酸中毒

正確答案：B. 代謝性酸中毒合併代謝性鹼中毒